關於頭顱的骨纖維發育不良症（fibrous dysplasia），下列何者錯誤？
A. 可能是McCune-Albright syndrome的一部分
B. 電腦斷層檢查可看見頭骨上出現ground glass matrix的影像表徵
C. 核醫檢查，如PET，是確定診斷的最佳工具
D. 臨床上多不會有疼痛的症狀

正確答案：C. 核醫檢查，如PET，是確定診斷的最佳工具